Clinical trial exclusion criterion:
Subject has cauda equina syndrome or neurogenic bowel/bladder dysfunction.

Entity relations:
- OR("cauda equina syndrome", "neurogenic bladder dysfunction", "neurogenic bowel dysfunction")